Clinical trial exclusion criterion:
History of severe pulmonary disease.

Entity relations:
- Has_temporal("severe pulmonary disease", "History")